Clinical trial inclusion criterion:
On chronic hemodialysis not yet on the transplant list and followed in the University's hemodialysis center or in the University's nephrology clinic

Entity relations:
- Has_qualifier("hemodialysis", "chronic")